Los reovirus.:
1. Se liberan de la célula por gemación.
2. Replican su material genético en el núcleo celular.
3. Tienen envoltura lipídica.
4. Forman viriones resistentes al pH ácido.
5. Se transmiten por vía sanguínea.

Respuesta correcta: 4. Forman viriones resistentes al pH ácido.